Clinical trial exclusion criterion:
History of active rheumatic diseases

Annotated entities:
- Condition: "rheumatic diseases"
- Qualifier: "active"